手腕屈肌支持帶（flexor retinaculum）的內側附著於何處？
A. 豆狀骨（pisiform）及狀骨（hamate）
B. 豆狀骨（pisiform）及三角骨（triquetrum）
C. 狀骨（hamate）及頭狀骨（capitate）
D. 尺骨莖突（ulnar styloid process）

正確答案：A. 豆狀骨（pisiform）及狀骨（hamate）